Clinical trial inclusion criteria:
Elevated blood-cholesterol

Annotated entities:
- Measurement: "blood-cholesterol"
- Value: "Elevated"